Clinical trial exclusion criterion:
Documented life expectancy of less than 12 months

Entity relations:
- Has_value("life expectancy", "less than 12 months")